Patients who are currently receiving prasugrel

The above is a clinical trial exclusion criterion. Annotated with entity spans:
Patients who are currently receiving [Drug: prasugrel]